3. Previous CABG

The above is a clinical trial exclusion criterion. Annotated with entity spans:
[Parsing_Error: 3.] [Temporal: Previous] [Condition: CABG]